Clinical trial exclusion criterion:
History of active rheumatic diseases

Entity relations:
- Has_qualifier("rheumatic diseases", "active")